十四歲男童因為身材矮小而就診，他的父親身高 165 公分，第二性徵發育始於 14 歲，母親身高 152 公分，初經年齡為 13 歲 6 個月。此孩童最近一年生長速率正常，身體檢查顯示身高 141 公分（低於第三百分位），體重 31 公斤（第三百分位），左右睪丸均為 3 毫升，無陰毛發育，其他器官亦未發現異常，當時骨齡為 13 歲。此個案最可能的診斷為：
A. 生長激素缺乏症（growth hormone deficiency）
B. 甲狀腺低能症（hypothyroidism）
C. 體質性生長遲緩（constitutional growth delay）
D. 遺傳性身材矮小（genetic short stature）

正確答案：C. 體質性生長遲緩（constitutional growth delay）